Which deep learning-based algorithms are used for enhancer prediction?

EP-DNN and DEEP.